Clinical trial exclusion criterion:
Subject with any unstable medical, psychiatric, or substance abuse disorder that in the opinion of the investigator is likely to affect the subject's ability to complete the study or preclude the subject's participation in the study

Annotated entities:
- Qualifier: "unstable"
- Condition: "medical disorder"
- Condition: "psychiatric disorder"
- Condition: "substance abuse disorder"
- Non-representable: "in the opinion of the investigator"
- Qualifier: "likely to affect the subject's ability to complete the study"
- Qualifier: "preclude the subject's participation in the study"